La pérdida de neuronas dopaminérgicas del hipotálamo aumenta la secreción hipofisaria de:
1. Prolactina.
2. L-dopa.
3. GH.
4. FSH.

Respuesta correcta: 1. Prolactina.